穿越細胞膜（transmembrane）的蛋白質中，色胺酸（tryptophan）最常位於何處？
A. 細胞膜脂肪層內（intra-lipid bilayer）
B. 細胞質的水相中
C. 細胞膜脂肪層與細胞質水相之交接處
D. 緊鄰於甘胺酸（glycine）

正確答案：C. 細胞膜脂肪層與細胞質水相之交接處